Describe a cytokine release syndrome.

cytokine storm is an aberrant response from the host immune system that induces an exaggerated release of proinflammatory cytokines/chemokines.